Clinical trial exclusion criterion:
History of seizures

Entity relations:
- Has_temporal("seizures", "History")